Hemoglobin <1.05 g/dl at the time of initiation of therapy

The above is a clinical trial exclusion criterion. Annotated with entity spans:
[Measurement: Hemoglobin] [Value: <1.05 g/dl] [Temporal: at the time of initiation of therapy]